Clinical trial exclusion criterion:
Acute pain (less than 3 months in duration)

Annotated entities:
- Condition: "pain"
- Measurement: "duration"
- Value: "less than 3 months"
- Qualifier: "Acute"